王醫師因為要出國旅遊，交代診所的病人如果只想要拿藥的話，可以按	以前的處方，由護士直接蓋上王醫師的章，就讓他們去拿藥，王醫師的做法對嗎？
A. 不對，違反親自診療的義務
B. 為了方便病人無所謂
C. 只要釋出處方箋就可以
D. 王醫師如果有以電話問診就可以

正確答案：A. 不對，違反親自診療的義務